Clinical trial exclusion criterion:
Subjects had a history of seizures, neuroleptic malignant syndrome, clinically significant tardive dyskinesia, or other medical condition that would expose them to undue risk or interfere with study assessments.

Annotated entities:
- Condition: "seizures"
- Condition: "neuroleptic malignant syndrome"
- Qualifier: "clinically significant"
- Condition: "tardive dyskinesia"
- Non-representable: "or other medical condition that would expose them to undue risk or interfere with study assessments"
- Temporal: "history"